Clinical trial exclusion criterion:
2. Screening tool: TMS adult safety screening, MRI safety screening, Medical History.

Entity relations:
- Subsumes("Screening", "TMS adult safety screening")
- Subsumes("Screening", "MRI safety screening")
- Subsumes("Screening", "Medical History")